Clinical trial exclusion criterion:
Pregnant or nursing woman

Annotated entities:
- Condition: "Pregnant"
- Condition: "nursing"
- Person: "woman"